一位 50 歲女性，懷孕 3 次，生產 2 次，自然流產 1 次，因陰道異常出血至門診就診。以前她的月經規則，週期約 30 天，每次持續 5～6 天，經量適中，經期間僅輕微腹部悶痛；但最近半年來，她的月經變得紊亂，週期 15 至 22 天不等，而且一次持續 7～10 天，量多且有血塊。她否認懷孕，也沒有其他內科病史或開刀史。內診發現子宮頸平滑，子宮呈現不規則增大，觸壓時不會疼痛，兩側附屬物無明顯異常。超音波顯示子宮肌瘤且內膜厚度達 2.5 公分。則下一步最適當的處置為何？
A. 腹部電腦斷層檢查
B. 子宮切除（hysterectomy）
C. 安排子宮鏡檢查，必要時子宮內膜切片（endometrial biopsy）
D. 開立荷爾蒙製劑止血

正確答案：C. 安排子宮鏡檢查，必要時子宮內膜切片（endometrial biopsy）